下列關於游離肺（sequestration）的敘述，何者錯誤？
A. 可以分為肺葉外（extralobar）游離肺與肺葉內（intralobar）游離肺
B. 與正常肺部通常以支氣管相通
C. 其動脈供應主要來自主動脈
D. 治療以手術切除為主

正確答案：B. 與正常肺部通常以支氣管相通